Treated with nasal CPAP modalities = 5 cm H2O and FiO2 between 0.30 and 0.60 for at least 2 hours to maintain SpO2 90-95%;

The above is a clinical trial inclusion criterion. Annotated with entity spans:
Treated with [Measurement: nasal CPAP] modalities [Value: = 5 cm H2O] and [Measurement: FiO2] [Value: between 0.30 and 0.60] [Temporal: for at least 2 hours] to maintain [Measurement: SpO2] [Value: 90-95%];